Las siguientes reacciones de biotransformación hepática de fármacos son de tipo II, a excepción de:
1. Glucuronidación.
2. Desaminación.
3. Metilación.
4. Conjugación con glicina.
5. Acetilación.

Respuesta correcta: 2. Desaminación.